Subjects receiving any other investigational agents.

The above is a clinical trial exclusion criterion. Annotated with entity spans:
[Context_Error: Subjects receiving any other investigational agents.]